Clinical trial exclusion criterion:
Body Mass Index >35

Annotated entities:
- Measurement: "Body Mass Index"
- Value: ">35"